Body mass index: > 18.5 kg/m2

The above is a clinical trial inclusion criterion. Annotated with entity spans:
[Measurement: Body mass index]: [Value: > 18.5 kg/m2]